缺乏下列那一種細胞激素（cytokine）易導致 T 細胞無法分化成 Th2 形式？
A. IL-2
B. IL-4
C. IL-8
D. TGF-β

正確答案：B. IL-4